Clinical trial inclusion criterion:
History of gastro-intestinal or other organ bleeding

Annotated entities:
- Condition: "organ bleeding"
- Condition: "gastro-intestinal bleeding"
- Qualifier: "other"
- Temporal: "History"